Clinical trial exclusion criterion:
Past or present hepatitis B infection (positive hepatitis B serology)

Annotated entities:
- Condition: "hepatitis B infection"
- Measurement: "hepatitis B serology"
- Value: "positive"